Clinical trial inclusion criteria:
Male & female patients >= 18 and < 70 years of age
Positive HBeAg before starting NA treatment
Treated by a single NA (lamivudine, adefovir, entecavir or tenofovir) for 6 months to 5 years
Developed HBeAg seroconversion (HBeAg negative and ant-HBe negative) with undetectable HBV DNA by PCR based assay on NA treatment.
Negative urine or serum pregnancy test (for women of childbearing potential) documented within the 24-hour period prior to the first dose of test drug. Additionally, all females must be using reliable contraception during the study and for 3 months after treatment completion

Annotated entities:
- Person: "Male"
- Person: "female"
- Value: ">= 18 and < 70 years"
- Person: "age"
- Measurement: "HBeAg"
- Value: "Positive"
- Temporal: "before starting NA treatment"
- Reference_point: "starting NA treatment"
- Drug: "lamivudine"
- Drug: "adefovir"
- Drug: "entecavir"
- Drug: "tenofovir"
- Multiplier: "single"
- Drug: "NA"
- Procedure: "Treated"
- Temporal: "for 6 months to 5 years"
- Measurement: "HBeAg"
- Value: "seroconversion"
- Measurement: "HBeAg"
- Measurement: "ant-HBe"
- Value: "negative"
- Value: "negative"
- Value: "undetectable"
- Measurement: "HBV DNA"
- Procedure: "PCR based assay"
- Drug: "NA"
- Procedure: "treatment"
- Value: "Negative"
- Measurement: "serum pregnancy test"
- Measurement: "urine pregnancy test"
- Person: "women"
- Condition: "childbearing potential"
- Temporal: "within the 24-hour period prior to the first dose of test drug"
- Reference_point: "the first dose of test drug"
- Pregnancy_considerations: "Additionally, all females must be using reliable contraception during the study and for 3 months after treatment completion"